What are the effects of homozygosity of EDNRB mutations in addition to Hirschsprung disease?

EDNRB homozygous mutations have been found to account for the rare Waardenburg-Hirschsprung syndrome (WS), whereas heterozygous EDNRB missense mutations have been reported in isolated Hirschsprung disease patients.